The patients who have more than or equal to 3 target lesions

The above is a clinical trial exclusion criterion. Annotated with entity spans:
The patients who have [Multiplier: more than or equal to 3] [Condition: target lesions]